Clinical trial exclusion criterion:
Participant has a history of epilepsy or fits or unexplained black-outs other than vasovagal collapse

Entity relations:
- Has_qualifier("black-outs", "unexplained")
- Has_negation("vasovagal collapse", "other than")
- AND("black-outs", "vasovagal collapse")
- Has_temporal("epilepsy", "history")
- OR("epilepsy", "fits", "black-outs")